有關尿路結石形成之敘述，下列何者錯誤？
A. 形成尿酸結石（uric acid stone）的最重要因素是酸性的尿液（low urine pH）
B. 感染性結石（infection stone）在酸性尿液（low urine pH）中較易形成
C. 成年男性腎結石發生率較成年女性高
D. 尿路結石的發生率與體重和身體質量比（BMI）有關

正確答案：B. 感染性結石（infection stone）在酸性尿液（low urine pH）中較易形成